Clinical trial exclusion criterion:
Amiodarone. Subjects previously treated with amiodarone must have stopped the amiodarone at least 60 days prior to day 1 of SOF/LDV FDC

Annotated entities:
- Drug: "Amiodarone"
- Temporal: "at least 60 days prior to day 1 of SOF/LDV FDC"
- Reference_point: "day 1 of SOF/LDV FDC"
- Non-query-able: "Subjects previously treated with amiodarone must have stopped the amiodarone"